Clinical trial exclusion criterion:
serious surgery within 30 days

Entity relations:
- Has_qualifier("surgery", "serious")
- Has_temporal("surgery", "within 30 days")